Recipient < 14years of age

The above is a clinical trial exclusion criterion. Annotated with entity spans:
Recipient [Value: < 14years] of [Person: age]